En el modelo bicompartimental la constante híbrida “alfa”, que rige la disminución de los niveles plasmáticos del fármaco en la fase de disposición rápida, engloba a los procesos de:
1. Absorción y eliminación.
2. Distribución-retorno y eliminación.
3. Absorción y distribución-retorno.
4. Metabolismo y excreción.
5. Distribución-retorno.

Respuesta correcta: 2. Distribución-retorno y eliminación.